MDRD(Modification of Diet in Renal Disease) Estimated Glomerular filtration rate less than 60 mL / m2

The above is a clinical trial exclusion criterion. Annotated with entity spans:
[Qualifier: MDRD(Modification of Diet in Renal Disease)] [Measurement: Estimated Glomerular filtration rate] [Value: less than 60 mL / m2]